Singleton pregnancy at gestational age 36 weeks or more

The above is a clinical trial inclusion criterion. Annotated with entity spans:
[Condition: Singleton pregnancy] at [Measurement: gestational age] [Value: 36 weeks or more]